What is formative pluripotency?

Formative pluripotency features a gene regulatory network switch from the na ve state and comprises capacitation of enhancers, signaling pathways and epigenetic machinery in order to install competence for lineage specification.